Abdominal and complex cervical cerclage (e.g. bulging bag)

The above is a clinical trial exclusion criterion. Annotated with entity spans:
[Qualifier: Abdominal] and [Qualifier: complex] [Procedure: cervical cerclage] (e.g. [Qualifier: bulging bag])